Clinical trial exclusion criterion:
Inability to lie flat for 20-30 minutes (the anticipated amount of time to complete the MRI procedure)

Annotated entities:
- Condition: "Inability to lie flat"
- Qualifier: "20-30 minutes"
- Qualifier: "amount of time to complete the MRI procedure"